acutely sick (for example, crying, wheezing, bleeding, screaming or shaken)

The above is a clinical trial exclusion criterion. Annotated with entity spans:
[Condition: acutely sick] (for example, [Condition: crying], [Condition: wheezing], [Condition: bleeding], [Condition: screaming] or [Condition: shaken])